Para su selección, las enzimas lisosomales de nueva síntesis van marcadas con:
1. Monoubiquitina.
2. Manosa-6-fosfato.
3. Secuencia espiral de cuatro aminoácidos.
4. Fosfatidilinositol.

Respuesta correcta: 2. Manosa-6-fosfato.